Clinical trial inclusion criterion:
Signs of myocardial injury as indicated by elevated troponin levels

Entity relations:
- Has_value("troponin levels", "elevated")
- AND("myocardial injury", "troponin levels")